下列巴金森氏病（Parkinson's disease）臨床表徵，何者最不常見？
A. 顫抖（tremor）
B. l 僵硬（rigidity）
C. 動作遲緩（bradykinesia）
D. l 智力障礙（mental disturbance）

正確答案：D. l 智力障礙（mental disturbance）